會合聚集成 perineal body 的肌肉，不包括下列那一項？
A. internal sphincter
B. external sphincter
C. bulbospongiosus
D. transverse perineal muscle

正確答案：A. internal sphincter